Airflow Obstruction:

The above is a clinical trial inclusion criterion. Annotated with entity spans:
[Parsing_Error: Airflow Obstruction:]